維生素D可調控鈣質吸收及肌肉力度的強弱，抽血檢	何種項目可以測知體內維生素D含量不足？
A. 25 (OH) D
B. 1,25 (OH)2 D
C. 副甲狀腺素（PTH）
D. 血中游離鈣的濃度

正確答案：A. 25 (OH) D